腹裂（gastroschisis）最常見的合併異常是：
A. 水腎
B. 脊椎畸形
C. 腸道閉鎖
D. 食道閉鎖合併食道氣管管

正確答案：C. 腸道閉鎖